History of ischemic cerebrovascular disorders (e.g., stroke, transient ischemic attack) or ischemia of the spinal cord

The above is a clinical trial exclusion criterion. Annotated with entity spans:
History of [Condition: ischemic cerebrovascular disorders] (e.g., [Condition: stroke], [Condition: transient ischemic attack]) or [Condition: ischemia of the spinal cord]